Which was the first gene therapy to receive marketing authorization in the European Union?

The first gene therapy to receive marketing authorization in the European Union was Glybera (alipogene tiparvovec).